在 B 型細胞發育過程中，下列那一種再排列步驟最先發生？
A. 重鏈（heavy chain）基因之 V→D
B. 重鏈（heavy chain）基因之 D→J
C. 重鏈（heavy chain）基因之 V→J
D. 輕鏈（light chain）基因之 V→J

正確答案：B. 重鏈（heavy chain）基因之 D→J